3. Are physically unable to sit upright and still for 40 minutes

The above is a clinical trial exclusion criterion. Annotated with entity spans:
3. Are [Condition: physically unable to sit upright and still] [Multiplier: for 40 minutes]